Clinical trial inclusion criterion:
Body mass index (BMI) =18 to =30 kg/m2

Annotated entities:
- Measurement: "Body mass index"
- Measurement: "BMI"
- Value: "=18 to =30 kg/m2"